Clinical trial exclusion criterion:
Plan for diagnostic-only coronary angiography

Annotated entities:
- Procedure: "coronary angiography"
- Qualifier: "diagnostic-only"